Clinical trial exclusion criterion:
Anaphylactic reaction to neomycin

Entity relations:
- AND("Anaphylactic reaction", "neomycin")